Entre las características de la comunicación con la familia, señale la respuesta INCORRECTA:
1. Escuchar activamente.
2. Evitar utilizar el lenguaje técnico.
3. Reprimir la expresión de sentimientos.
4. Graduar la información negativa.

Respuesta correcta: 3. Reprimir la expresión de sentimientos.